Nonsurgical neonates and babies up to age 6 months with INR 1.5 or more who are deemed clinically to need plasma infusion.

The above is a clinical trial inclusion criterion. Annotated with entity spans:
[Condition: Nonsurgical] [Person: neonates] and [Person: babies] [Value: up to age 6 months] with [Measurement: INR] [Value: 1.5 or more] who are deemed clinically to [Condition: need] [Procedure: plasma infusion].